(1) Uterine abnormalities (e.g. septate, bicornuate and fibroid uterus, Asherman Syndrome).

The above is a clinical trial exclusion criterion. Annotated with entity spans:
(1) [Condition: Uterine abnormalities] (e.g. [Condition: septate], [Condition: bicornuate] and [Condition: fibroid uterus], [Condition: Asherman Syndrome]).